Clinical trial exclusion criterion:
Lumbar puncture within the previous two weeks

Annotated entities:
- Procedure: "Lumbar puncture"
- Temporal: "within the previous two weeks"